Patients with neuromuscular or neurosensory deficiency, which would limit the ability to assess pain levels

The above is a clinical trial exclusion criterion. Annotated with entity spans:
Patients with [Condition: neuromuscular] or [Condition: neurosensory deficiency], which would limit the ability to assess pain levels